taking medicine within one month.

The above is a clinical trial exclusion criterion. Annotated with entity spans:
taking [Drug: medicine] [Qualifier: within one month].